Clinical trial inclusion criterion:
age > 18 years

Entity relations:
- Has_value("age", "> 18 years")